Which drugs are included in the EE-4A regimen for Wilm's tumor?

EE-4A regimen includes dactinomycin and vincristine.